Clinical trial exclusion criterion:
Current treatment with a dopamine agonist

Annotated entities:
- Drug: "dopamine agonist"
- Temporal: "Current"